Clinical trial inclusion criterion:
18-50 ages

Annotated entities:
- Person: "ages"
- Value: "18-50"